acute hip fracture

The above is a clinical trial exclusion criterion. Annotated with entity spans:
[Qualifier: acute] [Condition: hip fracture]